一位健康者其體循環之動脈血 pH 值瞬間由 7.4 降低至 7.3，經過幾分鐘後會產生下列何種狀況？
A. 降低肺通氣量（ventilation）
B. 增加腦脊髓液中的二氧化碳分壓
C. 體循環動脈血 pH 值維持不變
D. 降低肺泡二氧化碳分壓

正確答案：D. 降低肺泡二氧化碳分壓